Clinical trial inclusion criterion:
Patients suspected to have vitamin B12 deficiency defined as a plasma vitamin B12 below the reference interval (<200 pmol/L).

Entity relations:
- Has_mood("vitamin B12 deficiency", "suspected")
- Subsumes("below the reference interval", "<200 pmol/L")
- Has_value("plasma vitamin B12", "below the reference interval")
- Subsumes("vitamin B12 deficiency", "plasma vitamin B12")